Clinical trial exclusion criterion:
history of renal diseases, a coagulation abnormality, a hepatic disease, or drug abuse

Annotated entities:
- Temporal: "history"
- Condition: "renal diseases"
- Condition: "coagulation abnormality"
- Condition: "hepatic disease"
- Condition: "drug abuse"